Clinical trial inclusion criterion:
Has a body mass index >27 and <47 kg/m2.

Annotated entities:
- Measurement: "body mass index"
- Value: ">27 and <47 kg/m2"